What is the genetic basis of Ohdo syndrome?

MED12 cause X-linked Ohdo syndromeIn